Clinical trial inclusion criteria:
Male and female adolescent patients, aged 13 to 17 years, diagnosed with RLS based on the IRLSSG consensus criteria (Allen RP 2014) (Appendix 2).
Total RLS severity score of 15 or greater on the IRLS rating scale at Visit 1 (screening) and at Visit 2 (baseline) (Appendix 8).
RLS symptoms for at least 4 of 7 consecutive evenings/nights during the screening period.
Body weight greater than 33.4 kg and a healthy weight using age-based body mass index (BMI) range 5th-85th percentile at screening and baseline. Appendix 3 contains BMI-for-age charts that can be consulted.
Estimated creatinine clearance of at least 60 mL/min (using the Cockcroft-Gault equation) at screening only.
Signed patient and parent Institutional Review Board (IRB)-approved informed consent/assent form (as applicable) before any study-related procedures are performed.

Annotated entities:
- Person: "Male"
- Person: "female"
- Person: "adolescent"
- Person: "aged"
- Value: "13 to 17 years"
- Condition: "RLS"
- Measurement: "IRLSSG consensus criteria"
- Measurement: "Total RLS severity score"
- Value: "15 or greater"
- Multiplier: "at least 4 of 7 consecutive evenings/nights"
- Condition: "RLS symptoms"
- Measurement: "Body weight"
- Value: "greater than 33.4 kg"
- Measurement: "body mass index"
- Measurement: "BMI"
- Value: "5th-85th percentile"
- Measurement: "Estimated creatinine clearance"
- Value: "at least 60 mL/min"
- Informed_consent: "Signed patient and parent Institutional Review Board (IRB)-approved informed consent/assent form (as applicable) before any study-related procedures are performed"